Clinical trial exclusion criterion:
No Down syndrome

Entity relations:
- Has_negation("Down syndrome", "No")